Clinical trial exclusion criterion:
Receipt of any investigational medicinal product within 30 days before randomization

Annotated entities:
- Non-query-able: "Receipt of any investigational medicinal product within 30 days before randomization"